What kind of molecule is AZD8601?

AZD8601 is a modified mRNA.